Clinical trial inclusion criterion:
Male and female patients, age 18-75 yrs.

Entity relations:
- Has_value("age", "18-75 yrs")
- OR("Male", "female")